Which bacterium has the smallest genome in base pairs yet found?

our results reveal that nasuia-alf has the smallest bacterial genome yet sequenced (112 kb), and that the sulcia-alf genome (190 kb) is smaller than that of sulcia in other insect lineages.